Indica cuál de los siguientes déficits da lugar a una glucogenosis:
1. Hexoquinasa.
2. Hexosaminidasa.
3. Glucosa 6-fosfatasa.
4. Fructosa 1,6-bisfosfatasa
5. Fructoquinasa.

Respuesta correcta: 3. Glucosa 6-fosfatasa.